一名眼部鈍性挫傷（blunt trauma）病患接受眼底檢查，何種發現與此次受傷較無關？
A. 黃斑部裂孔（macular hole）
B. 視網膜震傷（commotio retinae）
C. 黃斑部隱結（drusen）
D. 玻璃體出血（vitreous hemorrhage）

正確答案：C. 黃斑部隱結（drusen）